Clinical trial exclusion criterion:
Anticipated receipt of any vaccine other than DTaP, IPV, HBV, PCV13, or Hib during the first 60 hours after randomization

Entity relations:
- Has_index("during the first 60 hours after randomization", "randomization")
- Has_temporal("DTaP", "during the first 60 hours after randomization")
- Has_mood("DTaP", "Anticipated receipt")
- OR("DTaP", "Hib", "HBV", "IPV", "PCV13")